What histone trimethylation has been associated to RNA splicing?

Mostly H3K36me3 but there is some evidence that H3K4me3 may also play a role in splicing